Clinical trial exclusion criterion:
Preoperative complete parenteral or enteral feeding

Annotated entities:
- Temporal: "Preoperative"
- Condition: "complete parenteral feeding"
- Condition: "complete enteral feeding"